Subjects with a history of more than three adequate trials with an SSRI.

The above is a clinical trial exclusion criterion. Annotated with entity spans:
[Competing_trial: Subjects with a history of more than three adequate trials with an SSRI].